Clinical trial exclusion criterion:
Acquired deficiency of coagulation factors whose treatment is established

Annotated entities:
- Condition: "Acquired deficiency of coagulation factors"
- Qualifier: "whose treatment is established"